Clinical trial inclusion criterion:
Patients with histologically confirmed diagnosis of prostate cancer who have not yet developed bone metastases

Annotated entities:
- Measurement: "histologically"
- Value: "confirmed"
- Condition: "prostate cancer"
- Condition: "bone metastases"